Clinical trial exclusion criterion:
women who are pregnant or breast feeding; women of childbearing potential who do not consent to apply at least to methods of contraception. This criterion does not apply to postmenopausal women

Annotated entities:
- Person: "women"
- Condition: "pregnant"
- Observation: "breast feeding"
- Pregnancy_considerations: "women who are pregnant or breast feeding; women of childbearing potential who do not consent to apply at least to methods of contraception. This criterion does not apply to postmenopausal women"